What is the human RCA locus size in bps?

The human RCA locus is located on chromosome 1q21-32 and consists of approximately 150 tandemly repeated copies of a 9.1 kb locus.